Clinical trial inclusion criteria:
Diagnosis of heart failure according to Framingham criteria
Informed consent
Age 18 years or above

Annotated entities:
- Condition: "heart failure"
- Qualifier: "Framingham criteria"
- Informed_consent: "Informed consent"
- Person: "Age"
- Value: "18 years or above"